Clinical trial exclusion criterion:
Participant has received a community available influenza vaccine within <6 months

Annotated entities:
- Procedure: "influenza vaccine"
- Temporal: "within <6 months"